Clinical trial exclusion criterion:
Age > 85 years

Entity relations:
- Has_value("Age", "> 85 years")